一位 65 歲老先生突然產生右側眼睛無痛性的視力喪失，除此之外並無其他神經學的缺陷或症狀產生，是下列那一條血管阻塞所致？
A. 前大腦動脈（anterior cerebral artery）
B. 基底動脈（basilar artery）
C. 內頸動脈分支（branch of internal carotid artery）
D. 後大腦動脈（posterior cerebral artery）

正確答案：C. 內頸動脈分支（branch of internal carotid artery）